Clinical trial inclusion criterion:
Do not take beta-blocker, ACE inhibitor, or nitrate

Annotated entities:
- Negation: "Do not"
- Drug: "beta-blocker"
- Drug: "ACE inhibitor"
- Drug: "nitrate"